下列何者不是基底核 direct loop 的構造？
A. 紋狀體（striatum）
B. 內側蒼白球（inner globus pallidus）
C. 丘腦（thalamus）
D. 視丘下核（subthalamic nucleus）

正確答案：D. 視丘下核（subthalamic nucleus）